Clinical trial exclusion criterion:
History of psychiatric disorders other than unipolar major depression or generalized anxiety disorder (bipolar disorder, hypomania, and dysthymia are exclusion criteria);

Annotated entities:
- Condition: "psychiatric disorders"
- Negation: "other than"
- Condition: "unipolar major depression"
- Condition: "generalized anxiety disorder"
- Condition: "bipolar disorder"
- Condition: "hypomania"
- Condition: "dysthymia"